¿Qué técnica de investigación permite activar o inhibir determinadas regiones de la corteza cerebral con el objetivo de poder establecer relaciones de naturaleza causal entre actividad cerebral y comportamiento?:
1. Estimulación magnética transcraneal.
2. Magnetoencefalografía.
3. Tomografía axial computerizada (TAC).
4. Autorradiografía.

Respuesta correcta: 1. Estimulación magnética transcraneal.